Clinical trial inclusion criterion:
Healthy male or female adolescents, age 12 to 17 years (inclusive) at Screening, with a body mass index (BMI) that is greater than or equal to the United States-weighted mean of the 95th percentile based on age and sex with a body weight greater than 60 kilograms (kg). Participants with Type 2 diabetes mellitus (T2DM) may have a pre-existing or new diagnosis of T2DM.

Annotated entities:
- Condition: "Healthy"
- Person: "male"
- Person: "female"
- Person: "adolescents"
- Person: "age"
- Value: "12 to 17 years"
- Temporal: "at Screening"
- Measurement: "body mass index (BMI)"
- Value: "greater than or equal to the United States-weighted mean of the 95th percentile"
- Qualifier: "based on age"
- Qualifier: "based on sex"
- Measurement: "body weight"
- Value: "greater than 60 kilograms (kg)"
- Value: "greater than or equal to the 95th percentile"
- Non-representable: "Participants with Type 2 diabetes mellitus (T2DM) may have a pre-existing or new diagnosis of T2DM."